Clinical trial inclusion criterion:
Need for long-term oral anticoagulation;

Entity relations:
- Has_mood("long-term oral anticoagulation", "Need for")